Clinical trial exclusion criterion:
rheumatic disease (RA, SpA, SLE)

Entity relations:
- Subsumes("rheumatic disease", "RA")
- OR("RA", "SpA", "SLE")